Clinical trial exclusion criterion:
AST or ALT > 120

Annotated entities:
- Measurement: "AST"
- Measurement: "ALT"
- Value: "> 120"